Clinical trial exclusion criterion:
Individuals who are pregnant or actively breastfeeding

Annotated entities:
- Condition: "pregnant"
- Temporal: "actively"
- Observation: "breastfeeding"